Pregnant and lactating women, women who plan to become pregnant, or women of child bearing age not using reliable contraceptive measures.

The above is a clinical trial exclusion criterion. Annotated with entity spans:
[Pregnancy_considerations: Pregnant and lactating women, women who plan to become pregnant, or women of child bearing age not using reliable contraceptive measures.]